耳膜成形術（Myringoplasty）又稱為第幾型鼓室成形術（Tympanoplasty）？
A. 第 1 型
B. 第 2 型
C. 第 3 型
D. 第 4 型

正確答案：A. 第 1 型